Clinical trial exclusion criterion:
A positive result for HLA-B*1301 in those subjects randomised to the genetic screening arm.

Annotated entities:
- Measurement: "HLA-B*1301"
- Value: "positive"